Clinical trial exclusion criterion:
Currently prescribed medication with anti-epileptic activity (keppra, dilantin, tegretol, lamictal, topamax, etc.)

Entity relations:
- Has_qualifier("medication", "anti-epileptic activity")
- Subsumes("medication", "keppra")
- OR("keppra", "topamax", "tegretol", "dilantin", "lamictal")